張先生因為心悸被送到急診室，心電圖檢查發現有上心室心搏過速（supraventricular tachycardia），在旁之醫師馬上做頸動脈竇按摩以減輕其症狀，其主要作用機轉為何？
A. 抑制 Brainbridge 反射
B. 活化減壓反射（baroreflex）
C. 活化化學反射（chemoreflex）
D. 抑制迷走中樞（vagal center）

正確答案：B. 活化減壓反射（baroreflex）